一位 28 歲吸菸孕婦，被家人發現意識不清躺在浴室，由 119 送至甲醫院，3 小時後轉送至乙醫院（孕婦在救護車上及乙醫院皆使用 100%氧氣面罩），此時病患意識已恢復清醒，測得動脈血中 carboxyhemoglobin 為 8%，PaO2＝480 mmHg，則下列敘述何者正確？（註：吸菸者血中 carboxyhemoglobin 可達 5-10%）
A. 表示此吸菸孕婦沒有一氧化碳（CO）中毒
B. 會建議此孕婦使用高壓氧（Hyperbaric oxygen）治療
C. 一氧化碳對懷孕母親的毒性傷害比胎兒更嚴重
D. PaO2已達 480 mmHg，表示病患沒缺氧，應不需再使用氧氣治療

正確答案：B. 會建議此孕婦使用高壓氧（Hyperbaric oxygen）治療